下列那一種利尿劑最適用於急性肺水腫病人？
A. thiazide
B. ethacrynic acid
C. acetazolamide
D. spironolactone

正確答案：B. ethacrynic acid